Clinical trial inclusion criterion:
Hypertension - untreated (Systolic Blood Pressure (SBP) ≥ 140 mm Hg or Diastolic Blood Pressure (DBP) ≥ 90 mm Hg) or treated

Annotated entities:
- Condition: "Hypertension"
- Qualifier: "untreated"
- Measurement: "Systolic Blood Pressure (SBP)"
- Value: "≥ 140 mm Hg"
- Measurement: "Diastolic Blood Pressure (DBP)"
- Value: "≥ 90 mm Hg"
- Qualifier: "treated"